Through which pathway does epiregulin promote leptin secretion?

EREG increased leptin production and secretion in a dose-dependent manner in iAb fat explants via the EGFR/MAPK pathway.